Clinical trial exclusion criteria:
Pregnancy or lactating
Allergy to NAC
History of chronic pain
Use of opioids or neuropathic analgesics
Use of NAC prior to trial (< 1 month of planned surgery)
Alcoholism
Diabetes Mellitus (insulin therapy)
Asthma or Chronic Obstructive pulmonary Disease
Known renal function disorders (MDRD <ô0)
Known liver failure (bilirubin >1.Sx upper limit of normal)
No written lC by patient

Annotated entities:
- Condition: "Pregnancy"
- Condition: "lactating"
- Condition: "Allergy"
- Drug: "NAC"
- Condition: "chronic pain"
- Temporal: "History"
- Drug: "opioids"
- Drug: "neuropathic analgesics"
- Drug: "NAC"
- Temporal: "prior to trial"
- Reference_point: "trial"
- Temporal: "< 1 month"
- Mood: "planned"
- Procedure: "surgery"
- Condition: "Alcoholism"
- Condition: "Diabetes Mellitus"
- Drug: "insulin"
- Condition: "Asthma"
- Condition: "Chronic Obstructive pulmonary Disease"
- Condition: "renal function disorders"
- Measurement: "MDRD"
- Value: "<ô0"
- Condition: "liver failure"
- Measurement: "bilirubin"
- Value: ">1.Sx upper limit of normal"
- Informed_consent: "No written lC by patient"